Clinical trial exclusion criterion:
Patient whom the surgery is withhold or canceled

Annotated entities:
- Procedure: "surgery"
- Observation: "withhold"
- Observation: "canceled"